Acude a urgencias un lactante con 39º C de temperatura axilar, edema del párpado izquierdo y rinorrea del mismo lado. ¿Cuál es el diagnóstico más probable?
1. Pansinusitis.
2. Sinusitis maxilar izquierda.
3. Sinusitis etmoidal izquierda.
4. Sinusitis esfenoidal izquierda.
5. Sinusitis frontal izquierda.

Respuesta correcta: 3. Sinusitis etmoidal izquierda.